Clinical trial inclusion criterion:
Physicians Global Assessment score of 3 or 4 at baseline

Annotated entities:
- Measurement: "Physicians Global Assessment score"
- Value: "3"
- Value: "4"
- Temporal: "at baseline"